Clinical trial exclusion criterion:
14. Insulin-dependent diabetes mellitus.

Annotated entities:
- Parsing_Error: "14."
- Condition: "Insulin-dependent diabetes mellitus"